關於isoniazid之敘述，下列何者正確？
A. 抑制結核分枝桿菌細胞膜之生成
B. 只能以靜脈注射方式治療肺結核
C. 主要由肝臟之N-acetyltransferase代謝
D. 易產生視神經病變的副作用

正確答案：C. 主要由肝臟之N-acetyltransferase代謝